在尿素循環障礙（urea cycle defects）疾病中，下列敘述何者錯誤？
A. 除了瓜胺酸血症（citrullinemia）是性聯遺傳以外，其他的疾病，均為體染色體隱性遺傳（autosomal recessive）疾病
B. 患有尿素循環障礙的嬰兒，早期的症狀，常是餵食欠佳、嘔吐、昏睡、焦躁不安及呼吸急促
C. 維持性治療的原則是低蛋白飲食、補充必需胺基酸及建立氨排出之替代路徑
D. 急性期血氨的移除非常重要

正確答案：A. 除了瓜胺酸血症（citrullinemia）是性聯遺傳以外，其他的疾病，均為體染色體隱性遺傳（autosomal recessive）疾病